Willing to join in and sign the informed consent form.

The above is a clinical trial inclusion criterion. Annotated with entity spans:
[Informed_consent: Willing to join in and sign the informed consent form].